Administration of other antiarrhythmics for acute heart rate control (excluding adenosine)

The above is a clinical trial exclusion criterion. Annotated with entity spans:
Administration of other [Drug: antiarrhythmics] for [Qualifier: acute] [Procedure: heart rate control] ([Negation: excluding] [Drug: adenosine])